Clinical trial inclusion criterion:
For women of childbearing potential, a negative pregnancy test is required during screening

Entity relations:
- Has_value("pregnancy test", "negative")
- Has_index("during screening", "screening")
- Has_temporal("pregnancy test", "during screening")
- AND("women", "pregnancy test")
- AND("childbearing potential", "pregnancy test")